Clinical trial inclusion criterion:
Power Doppler score of >=10

Annotated entities:
- Measurement: "Power Doppler score"
- Value: ">=10"